關於幼兒持續性高胰島素症（hyperinsulinism）臨床表徵的敘述，下列何者錯誤？
A. 低血糖時血清胰島素濃度大於 10 μU/mL（正常值 5-10 μU/mL）
B. 血液酮體（ketone body）濃度高
C. 血清 C-peptide 值高
D. 於低血糖時施行升糖素刺激試驗（glucagon test），可使其血糖值上升 40 mg/dL 以上 17 10 歲大女童發生甲狀腺低能症，最常見的原因為：

正確答案：B. 血液酮體（ketone body）濃度高